多發性肌炎（polymyositis）那部分的肌肉通常不受到影響？
A. 頸部
B. 上臂
C. 大腿
D. 眼部

正確答案：D. 眼部